¿Cuál es la lesión anatomopatológica característica de la enfermedad de Creutzfeldt Jakob en el cerebro?
1. Reacción inflamatoria perineuronal.
2. Cuerpos de inclusión en las neuronas.
3. Acúmulos de depósitos fibrilares en el intersticio.
4. Vacuolización del neuropilo.

Respuesta correcta: 4. Vacuolización del neuropilo.